Clinical trial inclusion criterion:
Adult male and female aged 19 to 75 years

Entity relations:
- Has_value("aged", "19 to 75 years")